Clinical trial exclusion criterion:
Palpable fibroids or uterine prolapse: Grade 2 or 3.

Entity relations:
- Has_value("Grade", "2 or 3")
- AND("Palpable fibroids", "Grade")
- OR("Palpable fibroids", "uterine prolapse")